Mujer de 50 años que acude al servicio de urgencias por astenia, anorexia, pérdida de peso, ictericia, fiebre y dolor abdominal. No refiere antecedentes recientes de transfusión sanguínea, contactos sexuales de riesgo ni adicción a drogas de uso parenteral. Consumo habitual de 60 gramos diarios de alcohol durante los últimos cinco años, consumo que ha incrementado durante el mes previo por problemas familiares. Temperatura 38,5ºC, tensión arterial 100/60 mmHg. En la exploración física se observa desorientación temporo-espacial, malnutrición, asterixis, ictericia y hepatomegalia dolorosa. No ascitis ni datos de irritación peritoneal. En los exámenes de laboratorio destacan leucocitos 15.000/microlitro con 90% de polimorfonucleares, hematíes 3 millones/mm3, hemoglobina 10 g/dl, volumen corpuscular medio 115 fl, bilirrubina 15 mg/dl de predominio directo, AST (GOT) 300 UI/L, ALT (GPT) 120 UI/L, GGT 635 UI/L, prolongación del tiempo de protrombina mayor del 50 %. ¿Cuál es el diagnóstico más probable del cuadro que presenta la paciente?
1. Absceso hepático.
2. Colecistitis aguda.
3. Colangitis aguda.
4. Hepatitis alcohólica.
5. Pancreatitis aguda.

Respuesta correcta: 4. Hepatitis alcohólica.